Clinical trial exclusion criterion:
The patient has previously received anti-tumor biological targeted therapy

Annotated entities:
- Procedure: "anti-tumor biological targeted therapy"
- Temporal: "previously"